Clinical trial exclusion criterion:
7. Medical conditions expected to progress, recur, or change to such a degree to interfere with the assessment of the clinical and mental status.

Annotated entities:
- Parsing_Error: "7."
- Undefined_semantics: "Medical conditions expected to progress, recur, or change to such a degree to interfere with the assessment of the clinical and mental status."
- Subjective_judgement: "Medical conditions expected to progress, recur, or change to such a degree to interfere with the assessment of the clinical and mental status."
- Non-query-able: "Medical conditions expected to progress, recur, or change to such a degree to interfere with the assessment of the clinical and mental status."